Clinical trial inclusion criterion:
Serum or plasma creatinine level less than or equal to 2 times the upper limit of normal

Entity relations:
- Has_qualifier("creatinine level", "Serum")
- Has_value("creatinine level", "less than or equal to 2 times the upper limit of normal")
- OR("Serum", "plasma")